Clinical trial inclusion criterion:
Lobar pneumonia or pneumoniae with pleural effusion

Entity relations:
- AND("pneumoniae", "pleural effusion")
- OR("Lobar pneumonia", "pneumoniae")